Clinical trial exclusion criterion:
Age less than one year or over 18 years

Annotated entities:
- Person: "Age"
- Value: "less than one year"
- Value: "over 18 years"